20歲女性，在月經來前一個禮拜，因於性行為中突然發生劇烈下腹痛，至急診室求診。懷孕測試為陰性，觸診下腹有廣泛性壓痛點，陰道超音波發現右側卵巢有一6公分回音不均勻腫塊且有腹腔積液約180 mL，血壓脈搏穩定，實	室檢查血紅素為10.5 g/dL，CA-125為38 U/mL；下列診斷何者較為適當？
A. 子宮外孕破裂
B. 輸卵管卵巢膿瘍
C. 卵巢黃體囊腫出血
D. 卵巢畸胎瘤

正確答案：C. 卵巢黃體囊腫出血